Clinical trial inclusion criteria:
Evidence of Mycoplasma pneumoniae infection
Lobar pneumonia or pneumoniae with pleural effusion

Annotated entities:
- Condition: "Mycoplasma pneumoniae infection"
- Condition: "Lobar pneumonia"
- Condition: "pneumoniae"
- Condition: "pleural effusion"